Clinical trial exclusion criterion:
previous thoracic surgery or thrombolytic therapy for pleural infection;

Entity relations:
- Has_temporal("thoracic surgery", "previous")
- AND("thoracic surgery", "pleural infection")
- OR("thoracic surgery", "thrombolytic therapy")